History of allergies to phenol, any of the antibiotics listed in the vaccine content, or any other component of ACAM2000 or its diluents.

The above is a clinical trial exclusion criterion. Annotated with entity spans:
History of [Condition: allergies] to [Drug: phenol], any of the [Procedure: antibiotics] [Qualifier: listed in the vaccine content], or any other component of [Drug: ACAM2000] or its diluents.